Subject who would receive more than 4500 euros of compensation due to his participation in other biomedical research in the 12 months preceding this study

The above is a clinical trial exclusion criterion. Annotated with entity spans:
[Non-query-able: Subject who would receive more than 4500 euros of compensation due to his participation in other biomedical research in the 12 months preceding this study]